El procedimiento inicial de elección para investigar una posible obstrucción de las vías biliares es:
1. Ecografía hepatobiliar.
2. Colangiopancreatografia retrógrada endoscópica (CPRE).
3. Colangio Resonancia Magnética.
4. Tomografía computerizada. TC abdominal.
5. Colangiografía transhepática percutánea.

Respuesta correcta: 1. Ecografía hepatobiliar.